What is the genetic basis of progeria

Mutations in the LMNA gene cause Hutchinson-Gilford progeria syndrome in around 90% of patients